Clinical trial exclusion criteria:
impaired decision making
neurofibromatosis
signs for central dysfunction
remaining vestibular function
Patients are advised not to participate in the gentamicin arm if
hearing is better than 30 deciBel (dB) in pure tone average (500, 1000, 2000, 3-4000 Hz) and speech discrimination better than 70%
the neurosurgeon aim at hearing preservation surgery and do not want to risk gentamicin associated hearing loss

Annotated entities:
- Condition: "impaired decision making"
- Condition: "neurofibromatosis"
- Mood: "signs"
- Condition: "central dysfunction"
- Condition: "remaining vestibular function"
- Non-representable: "Patients are advised not to participate in the gentamicin arm if"
- Measurement: "hearing"
- Value: "better than 30 deciBel (dB)"
- Qualifier: "pure tone average"
- Qualifier: "500, 1000, 2000, 3-4000 Hz"
- Measurement: "speech discrimination"
- Value: "better than 70%"
- Non-representable: "the neurosurgeon aim at hearing preservation surgery and do not want to risk gentamicin associated hearing loss"